Which kinase is regulating stress granule biogenesis?

5'-AMP-activated protein kinase alpha regulates stress granule biogenesis